20. History of allogeneic organ transplant

The above is a clinical trial exclusion criterion. Annotated with entity spans:
[Parsing_Error: 20.] [Temporal: History] of [Procedure: allogeneic organ transplant]